¿Cuál de las siguientes afirmaciones es cierta con respecto a la dispareunia?
1. Este trastorno sólo afecta a las mujeres.
2. La característica esencial es la contracción involuntaria de los músculos perineales del tercio externo de la vagina, frente a la introducción del pene, los dedos, los tampones, o los espéculos.
3. Este trastorno aparece de toda la vida, no puede ser adquirido.
4. Este trastorno consiste en dolor genital durante el coito, aunque puede aparecer antes o después de la relación sexual.
5. Esta alteración no provoca malestar en las relaciones interpersonales.

Respuesta correcta: 4. Este trastorno consiste en dolor genital durante el coito, aunque puede aparecer antes o después de la relación sexual.